Clinical trial inclusion criterion:
On stable anti-parkinsonian therapy for 2 weeks before enrollment

Entity relations:
- Has_multiplier("anti-parkinsonian therapy", "for 2 weeks")
- Has_qualifier("anti-parkinsonian therapy", "stable")
- Has_temporal("anti-parkinsonian therapy", "before enrollment")